What distinguishes RIDLs from other transpozable elements?

Repeat Insertion Domains of LncRNAs (RIDLs) are exonic TEs that are essential for lncRNA function.